下列何種腦血管疾病最不可能發生於兒童？
A. 缺血性腦梗塞（ischemic infarction）
B. 澱粉樣血管病變（amyloid angiopathy）
C. 先天性心臟病及突發性血栓症（congenital heart disease and paradoxical embolism）
D. moyamoya disease

正確答案：B. 澱粉樣血管病變（amyloid angiopathy）